willingness to transmit glucose and medication information weekly

The above is a clinical trial inclusion criterion. Annotated with entity spans:
[Non-query-able: willingness to transmit glucose and medication information weekly]